誤食農藥，造成呼吸困難，肺部彈性降低（low compliance），X光顯示瀰漫性肺陰影。其診斷最有可能是：
A. 成人呼吸窘迫症候群（ARDS）
B. 肺氣腫（pulmonary emphysema）
C. 急性氣管炎（acute bronchitis）
D. Wegener氏肉芽腫病（Wegener's granulomatosis）

正確答案：A. 成人呼吸窘迫症候群（ARDS）